Una de las principales limitaciones del tratamiento conductual (exposición con prevención de respuesta) del TOC es:
1. Su reciente aparición.
2. La reducida eficacia en comparación con los tratamientos cognitivos y farmacológicos.
3. La carencia de un modelo teórico explicativo.
4. La dificultad de aplicación en casos de rituales motores.
5. La existencia de un porcentaje relevante de pacientes que rechazan el tratamiento por su carácter aversivo.

Respuesta correcta: 5. La existencia de un porcentaje relevante de pacientes que rechazan el tratamiento por su carácter aversivo.